Contraindication for prescription of Firmagon®

The above is a clinical trial exclusion criterion. Annotated with entity spans:
[Condition: Contraindication] for prescription of [Drug: Firmagon]®